Clinical trial inclusion criterion:
Ability to self-administer inhaled AAT.

Annotated entities:
- Observation: "self-administer inhaled AAT"
- Post-eligibility: "Ability to self-administer inhaled AAT."